Clinical trial inclusion criterion:
Score greater than 8 on Children's Yale-Brown Obsessive Compulsive Scale

Entity relations:
- Has_value("Children's Yale-Brown Obsessive Compulsive Scale", "greater than 8")